Clinical trial exclusion criterion:
Subject has active tuberculosis or has had tuberculosis in the past three (3) years.

Entity relations:
- OR("tuberculosis", "in the past three (3) years", "tuberculosis")